Clinical trial exclusion criterion:
History of psychiatric disorders or cognitive impairment

Annotated entities:
- Condition: "psychiatric disorders"
- Condition: "cognitive impairment"